最常見的乳癌為：
A. invasive ductal carcinoma
B. carcinosarcoma
C. lobular carcinoma in situ
D. medullary carcinoma

正確答案：A. invasive ductal carcinoma